Clinical trial exclusion criteria:
History of cardiovascular disease;
Current pregnancy;
Uncontrolled hypertension;
Uncontrolled hyperlipidemia;
Current hormone replacement therapy;
Current use of tobacco products;
Elevated liver enzymes;
Current autoimmune disease;
Daily use of of antioxidants >300mg

Annotated entities:
- Condition: "cardiovascular disease"
- Temporal: "History"
- Temporal: "Current"
- Condition: "pregnancy"
- Condition: "hypertension"
- Qualifier: "Uncontrolled"
- Qualifier: "Uncontrolled"
- Condition: "hyperlipidemia"
- Procedure: "hormone replacement therapy"
- Temporal: "Current"
- Observation: "use of tobacco products"
- Temporal: "Current"
- Condition: "Elevated liver enzymes"
- Condition: "autoimmune disease"
- Temporal: "Current"
- Multiplier: "Daily use"
- Drug: "antioxidants"
- Multiplier: ">300mg"